Clinical trial exclusion criterion:
Guillain- Barré syndrome within eight weeks of a previous influenza vaccine

Annotated entities:
- Condition: "Guillain- Barré syndrome"
- Temporal: "within eight weeks of a previous influenza vaccine"
- Reference_point: "a previous influenza vaccine"
- Temporal: "previous"
- Drug: "influenza vaccine"